Clinical trial exclusion criterion:
With severe comorbidities, such as cardiovascular disease, chronic obstructive pulmonary disease, diabetes mellitus, and chronic renal dysfunction.

Entity relations:
- Has_qualifier("comorbidities", "severe")
- Subsumes("comorbidities", "cardiovascular disease")
- OR("cardiovascular disease", "diabetes mellitus", "chronic obstructive pulmonary disease", "chronic renal dysfunction")